Clinical trial inclusion criteria:
Hospitalised children aged 3-mo to 5-yrs (in Darwin, children have to be Indigenous)
Have features of severe pneumonia on admission (temperature >37.5 celsius or a history of fever at home or observed at the referring clinic, age-adjusted tachypnoea [respiratory rate>50 if <12-months; respiratory rate>40 if >12-months] with chest wall recession and/or oxygen saturation <92% in air), and consolidation on chest X-ray as diagnosed by treating clinician
After 1-3 days of IV antibiotics, are afebrile, with improved respiratory symptoms and signs, oxygen saturation>90% in air and are ready to be switched to oral amoxicillin-clavulanate, and
Have symptoms of no longer than 7 days at point of hospitalisation.

Annotated entities:
- Visit: "Hospitalised"
- Person: "children"
- Person: "aged"
- Value: "3-mo to 5-yrs"
- Condition: "pneumonia"
- Qualifier: "severe"
- Measurement: "temperature"
- Value: ">37.5 celsius"
- Person: "age"
- Condition: "tachypnoea"
- Measurement: "respiratory rate"
- Value: ">50"
- Value: "<12-months"
- Value: ">12-months"
- Measurement: "respiratory rate"
- Value: ">40"
- Person: "age"
- Condition: "chest wall recession"
- Measurement: "oxygen saturation"
- Value: "<92% in air"
- Condition: "consolidation"
- Procedure: "chest X-ray"
- Non-query-able: "After 1-3 days of IV antibiotics, are afebrile, with improved respiratory symptoms and signs, oxygen saturation>90% in air and are ready to be switched to oral amoxicillin-clavulanate, and"
- Condition: "symptoms"
- Temporal: "no longer than 7 days at point of hospitalisation"
- Reference_point: "hospitalisation"